一位51歲男性，30年前即被診斷為B型肝炎帶原者。病患以往身體無其他不適，每天喝酒（高梁酒約100～ 150 c.c.）。最近一個月陸續有腹痛、嘔吐及下痢。到醫院門診時，生命跡象正常，但眼膜有些黃疸 （jaundice），則下一步最不需要何種檢查？
A. 血清胎兒蛋白指數（α-fetoprotein）
B. 血清梅毒檢查
C. 凝血時間檢查
D. 肝功能

正確答案：B. 血清梅毒檢查